Clinical trial exclusion criterion:
Serum albumin level less than 2 g / dL

Entity relations:
- Has_value("Serum albumin level", "ess than 2 g / dL")